Clinical trial inclusion criterion:
Patient is eligible for PCI

Annotated entities:
- Procedure: "PCI"
- Mood: "eligible"